Clinical trial exclusion criterion:
Multiple bone metastasis or central nervous system metastasis

Annotated entities:
- Condition: "Multiple bone metastasis"
- Condition: "central nervous system metastasis"